Clinical trial inclusion criterion:
Platelet count ≥ 75,000/mcL

Entity relations:
- Has_value("Platelet count", "≥ 75,000/mcL")